Clinical trial exclusion criteria:
diabetes
ischemic heart disease or any abnormality on treadmill stress test
inflammatory or chronic disorder
pregnancy
lactation
creatinine level of 1,5 mg/dL or more
gastrointestinal problems or musculoskeletal disorders that would prevent them to follow the test diets or exercise interventions
liver dysfunction with a factor of at least 3 above the upper limit of normal in AST and ALT levels
thyroid dysfunction, with serum TSH out of normal limits
use of immunosuppressive drugs, corticosteroids or anorexigen

Annotated entities:
- Condition: "diabetes"
- Condition: "ischemic heart disease"
- Measurement: "treadmill stress test"
- Value: "abnormality"
- Condition: "disorder inflammatory"
- Condition: "chronic disorder"
- Condition: "pregnancy"
- Condition: "lactation"
- Measurement: "creatinine level"
- Value: "1,5 mg/dL or more"
- Condition: "gastrointestinal problems"
- Condition: "musculoskeletal disorders"
- Mood: "prevent"
- Negation: "prevent"
- Procedure: "test diets"
- Procedure: "exercise interventions"
- Condition: "liver dysfunction"
- Value: "factor of at least 3 above the upper limit of normal"
- Measurement: "AST levels"
- Measurement: "ALT levels"
- Condition: "thyroid dysfunction"
- Measurement: "serum TSH"
- Value: "out of normal limits"
- Drug: "immunosuppressive drugs"
- Drug: "corticosteroids"
- Drug: "anorexigen"